Clinical trial exclusion criterion:
Acute illness or infection;

Entity relations:
- Has_qualifier("illness", "Acute")
- OR("illness", "infection")